Vitamin B12 and/or serum folate deficiency according to the laboratory (re-screening is possible after substitution therapy).

The above is a clinical trial exclusion criterion. Annotated with entity spans:
[Condition: Vitamin B12] and/or [Condition: serum folate deficiency] according to the laboratory (re-screening is possible after substitution therapy).